Clinical trial inclusion criterion:
Bilirubin <2.0 mg/dl or SGOT <3.0 X the upper limit of normal.

Annotated entities:
- Measurement: "Bilirubin"
- Value: "<2.0 mg/dl"
- Measurement: "SGOT"
- Value: "<3.0 X the upper limit of normal"